Clinical trial exclusion criterion:
contraindication to laparoscopy

Annotated entities:
- Condition: "contraindication"
- Procedure: "laparoscopy"